Allergy to rosuvastatin or parvastatin

The above is a clinical trial exclusion criterion. Annotated with entity spans:
[Condition: Allergy] to [Drug: rosuvastatin] or [Drug: parvastatin]